下列有關克隆氏病（Crohn's disease）之敘述，何者錯誤？
A. 易併發管（fistula）及腸阻塞
B. 腸內的病灶為連繼性（continuous lesion）
C. 病人有週邊白血球過多及電解質不平衡現象
D. 臨床表徵不一

正確答案：B. 腸內的病灶為連繼性（continuous lesion）